一項有關甲疾病及乙檢驗的研究顯示有甲疾病且乙檢驗陽性者 90 人，有甲疾病但乙檢驗陰性者 10 人，無甲疾病但乙檢驗陽性者 10 人，無甲疾病且乙檢驗陰性者 190 人。則乙檢驗診斷甲疾病之特異性（specificity）為：
A. 10%
B. 80%
C. 90%
D. 95%

正確答案：D. 95%